menopause

The above is a clinical trial exclusion criterion. Annotated with entity spans:
[Condition: menopause]